No relapse of a previously unrecognized ALL

The above is a clinical trial inclusion criterion. Annotated with entity spans:
[Negation: No] [Condition: relapse] of a [Qualifier: previously unrecognized] [Condition: ALL]